Clinical trial inclusion criterion:
patients who underwent successful TAVI

Annotated entities:
- Procedure: "TAVI"
- Qualifier: "successful"